紅血球生成素（erythropoietin; EPO）的作用機制牽涉到JAK-STAT（Janus kinase-signal transducers and activators of transcription）系統。下列敘述何者正確？
A. EPO受體為JAK蛋白質
B. EPO與受體結合後，受體蛋白質會被JAK磷酸化
C. EPO與受體結合後，受體蛋白質會被STAT磷酸化
D. EPO與受體結合形成的 complex 會移入細胞核內，調控特定基因的表現

正確答案：B. EPO與受體結合後，受體蛋白質會被JAK磷酸化